Clinical trial inclusion criterion:
All subjects are willing to complete the 6-weeks period clinical trial.

Annotated entities:
- Post-eligibility: "All subjects are willing to complete the 6-weeks period clinical trial"